Clinical trial inclusion criterion:
Good oral tolerance

Annotated entities:
- Condition: "oral tolerance"
- Qualifier: "Good"